阻塞性肺病且合併有支氣管擴張症者，過去常常服用抗生素，其痰液培養最常見的細菌為：
A. Staphylococcus aureus
B. Haemophilus influenzae
C. Pseudomonas aeruginosa
D. Klebsiella pneumoniae

正確答案：C. Pseudomonas aeruginosa